Clinical trial exclusion criterion:
OAT required for reasons not related to AF (i.e., prosthetic valve, PV stenosis, previous pulmonary embolism, presence of spontaneous echo contrast [SEC] at standard echo performed at 3-months follow-up).

Entity relations:
- Has_qualifier("OAT", "AF")
- Has_negation("AF", "not")
- Has_index("3-months follow-up", "follow-up")
- Has_temporal("standard echo", "3-months follow-up")
- Has_value("standard echo", "spontaneous echo contrast")
- Subsumes("spontaneous echo contrast", "SEC")
- AND("OAT", "prosthetic valve")
- OR("prosthetic valve", "PV stenosis", "pulmonary embolism", "standard echo")